Clinical trial exclusion criterion:
Patients with a clinically significant disease (chronic, recurrent or active).

Annotated entities:
- Qualifier: "clinically significant"
- Condition: "disease"
- Qualifier: "chronic"
- Qualifier: "recurrent"
- Qualifier: "active"